下列何者是引起僧帽瓣狹窄（mitral stenosis）最常見的原因？
A. 感染性心內膜炎
B. 先天性異常
C. 風濕性心臟病
D. 類風濕性心臟病

正確答案：C. 風濕性心臟病